Patients criteria

The above is a clinical trial exclusion criterion. Annotated with entity spans:
[Non-representable: Patients criteria]